Clinical trial exclusion criterion:
Clinically significant laboratory abnormalities

Annotated entities:
- Qualifier: "Clinically significant"
- Condition: "laboratory abnormalities"
- Procedure: "laboratory"